List the stages/types of Multiple Sclerosis.

Multiple Sclerosis (MS) is a multisystem disorder, which can be classified into primary progressive, relapsing-remitting, relapping-remoting and non-progressive stages.